Clinical trial exclusion criterion:
16. Subject has normal or insignificant coronaries (i.e. coronary lesion(s) less than 50% stenosis).

Entity relations:
- multi("less than 50% stenosis", "stenosis")
- multi("coronary lesion", "coronary lesion")
- Has_value("coronary lesion", "less than 50% stenosis")